Participation in other clinical trials within 3 months to the enrollment in this study.

The above is a clinical trial exclusion criterion. Annotated with entity spans:
[Competing_trial: Participation in other clinical trials within 3 months to the enrollment in this study.]